Patients with untreated central nervous system disease. Patients with controlled treated CNS lesions who have undergone surgery or stereotactic radiosurgery and stable for 4 weeks are eligible.

The above is a clinical trial exclusion criterion. Annotated with entity spans:
Patients with [Qualifier: untreated] [Condition: central nervous system disease]. Patients with [Qualifier: controlled] [Qualifier: treated] [Condition: CNS lesions] who have undergone [Procedure: surgery] or [Procedure: stereotactic radiosurgery] and [Qualifier: stable] [Temporal: for 4 weeks] are eligible.